Body mass index (BMI) > 45 kg/m2.

The above is a clinical trial exclusion criterion. Annotated with entity spans:
[Measurement: Body mass index] ([Measurement: BMI]) [Value: > 45 kg/m2].